下列描述何者正確？
A. 愛滋病毒（HIV）較 B 型肝炎病毒更容易從病人傳給醫生
B. 住院病人均應檢查 B 型肝炎病毒的抗體
C. 所有醫療照顧人員均應篩檢 B 型肝炎病毒表面抗原
D. 所有醫療照顧人員均應篩檢 B 型肝炎病毒表面抗體

正確答案：D. 所有醫療照顧人員均應篩檢 B 型肝炎病毒表面抗體